Patient is suffering with unstable angina in last one week.

The above is a clinical trial exclusion criterion. Annotated with entity spans:
Patient is suffering with [Condition: unstable angina] in [Temporal: last one week].